Clinical trial exclusion criterion:
Severe illness warranting hospital referral

Annotated entities:
- Condition: "illness"
- Qualifier: "Severe"
- Procedure: "hospital referral"
- Mood: "warranting"